Clinical trial inclusion criterion:
9. Body weight > 30 kg

Annotated entities:
- Parsing_Error: "9."
- Measurement: "Body weight"
- Value: "> 30 kg"